Clinical trial exclusion criterion:
Evidence of decompensated liver disease

Entity relations:
- Has_qualifier("liver disease", "decompensated")